Clinical trial inclusion criterion:
Participants and their families not planning to move away from the area for the duration of the study

Entity relations:
- Has_index("for the duration of the study", "the study")
- Has_negation("planning to move away", "not")
- Has_temporal("planning to move away", "for the duration of the study")